serious complications such as uncontrolled diabetes, gastric ulcer or other serious angiocardiopathy determined by the physician

The above is a clinical trial exclusion criterion. Annotated with entity spans:
[Qualifier: serious] [Condition: complications] such as [Qualifier: uncontrolled] [Condition: diabetes], [Condition: gastric ulcer] or other [Qualifier: serious] [Condition: angiocardiopathy] [Subjective_judgement: determined by the physician]